Clinical trial inclusion criterion:
Able to give informed consent

Annotated entities:
- Post-eligibility: "Able to give informed consent"